Clinical trial inclusion criterion:
Estimated creatinine clearance of at least 60 mL/min (using the Cockcroft-Gault equation) at screening only.

Annotated entities:
- Measurement: "Estimated creatinine clearance"
- Value: "at least 60 mL/min"